下列關於旅遊相關的細菌性腹瀉處理的敘述，何者不恰當？
A. 以含電解質及糖之液體補充體液
B. 嬰幼兒發燒超過 24 小時，有血便，或腹瀉持續數天，應就醫進行診治
C. 嬰幼兒有血便及發燒，投予口服第一代 cephalosporin
D. 老年人有血便及發燒，投予口服 fluoroquinolones

正確答案：C. 嬰幼兒有血便及發燒，投予口服第一代 cephalosporin